Which R packages have been developed for the discovery of mutational signatures in cancer?

signeR is an R package for a new method for the statistical estimation of mutational signatures based on an empirical Bayesian treatment of the NMF model.